Clinical trial inclusion criterion:
T1DM for at least 12 months

Entity relations:
- Has_temporal("T1DM", "for at least 12 months")